Bilateral symmetrically impacted lower third molars according to Pel-Gregory's and Winter's classification

The above is a clinical trial inclusion criterion. Annotated with entity spans:
[Value: Bilateral symmetrically impacted lower third molars] according to [Measurement: Pel-Gregory's and Winter's classification]